有關尿道下裂（hypospadias）之敘述，下列何者錯誤？
A. 是依據尿道開口位置來分型
B. 手術矯正年齡最好是學齡前約6歲，以免兒童心理受到影響
C. 嚴重的尿道下裂，多需要取周圍的皮瓣來做尿道重建
D. 常合併有陰莖彎曲（chordee），尤其是尿道開口在近端的類型

正確答案：B. 手術矯正年齡最好是學齡前約6歲，以免兒童心理受到影響